What cellular process is JAK/STAT involved in?

JAK/STAT is a master regulator of immunity